Respiratory muscle weakness (Pi,max < 70cmH2O)

The above is a clinical trial inclusion criterion. Annotated with entity spans:
[Condition: Respiratory muscle weakness] ([Measurement: Pi,max] [Value: < 70cmH2O])